Clinical trial exclusion criterion:
Myocardial infarction, cardiac arrest or cardiac failure within 1 year before screening/baseline visit;

Annotated entities:
- Condition: "Myocardial infarction"
- Condition: "cardiac arrest"
- Condition: "cardiac failure"
- Temporal: "within 1 year before screening/baseline visit"